Clinical trial inclusion criterion:
Diagnosed with cutaneous vasculitis, urticaria, psoriasis, acne, bullous skin diseases, sterile pustulosis, leprosy, pneumocystis pneumonia and any other patients who need dapsone administration.

Annotated entities:
- Condition: "cutaneous vasculitis"
- Condition: "urticaria"
- Condition: "psoriasis"
- Condition: "acne"
- Condition: "bullous skin diseases"
- Condition: "sterile pustulosis"
- Condition: "leprosy"
- Condition: "pneumocystis pneumonia"
- Drug: "dapsone"